Clinical trial exclusion criterion:
(ii) measles (M) or measles, mumps, rubella (MMR) routine vaccination, which can be administered concomitantly with the first dose of study vaccine as per routine immunization schedule

Annotated entities:
- Procedure: "measles (M) vaccination"
- Procedure: "measles, mumps, rubella (MMR) vaccination"
- Temporal: "concomitantly with the first dose of study vaccine"
- Reference_point: "the first dose of study vaccine"